Patients free of active respiratory disease such as acute respiratory signs/symptoms (e.g., wheezing) or with active airways disease (asthma, chronic obstructive pulmonary disease or emphysema).

The above is a clinical trial inclusion criterion. Annotated with entity spans:
Patients [Negation: free] of [Qualifier: active] [Condition: respiratory disease] such as [Condition: acute respiratory signs]/symptoms (e.g., [Condition: wheezing]) or with [Qualifier: active] [Condition: airways disease] ([Condition: asthma], [Condition: chronic obstructive pulmonary disease] or [Condition: emphysema]).